La “práctica programada” es un tipo de intervención psicológica que se ha utilizado principalmente en:
1. La agorafobia.
2. El trastorno obsesivo-compulsivo.
3. La anorexia nerviosa.
4. La hipocondría.
5. La fobia social.

Respuesta correcta: 1. La agorafobia.